Clinical trial exclusion criterion:
Smokers of > 5 cigarettes a day.

Annotated entities:
- Person: "Smokers"
- Observation: "cigarettes"
- Multiplier: "> 5 a day"